一位 35 歲男病患經診斷為結腸癌，他的母親在 20 歲時被診斷有子宮內膜癌，48 歲時被診斷有結腸癌。他外祖父 55 歲時死於結腸癌，他 38 歲的姊姊最近接受一次大腸鏡的檢查，被診斷有第一期直腸癌，但沒有發現息肉。下列那種突變跟他的結腸癌最可能有相關性？
A. germ-line 的 hMSH2 gene 突變或低表現
B. ATM gene 的喪失異型結合（loss of heterozygosity）
C. p53 的單邊等位 germ-line 基因突變（germ-line mutation of a single allele of p53 gene）
D. 體細胞的 nucleotide excision repair gene 突變

正確答案：A. germ-line 的 hMSH2 gene 突變或低表現